一位接受腎臟移植手術的病患，需長期服用環孢靈素（cyclosporine）來對抗排斥作用，下列有關此藥之敘述，何者正確？
A. 環孢靈素不會產生腎毒性，最適合腎臟移植病患使用
B. 環孢靈素經過細胞色素 P450（cytochrome P450）代謝，變成親水性，從腎臟排泄
C. 葡萄柚汁（grapefruit）本身含有類黃酮（flavonoid），能幫助電子傳遞，與環孢靈素一起服用不會影響環孢靈素血中濃度
D. 抗生素紅黴素（erythromycin）並不經由細胞色素 P450 代謝，因而不會影響環孢靈素血中濃度

正確答案：B. 環孢靈素經過細胞色素 P450（cytochrome P450）代謝，變成親水性，從腎臟排泄